Clinical trial inclusion criterion:
Cough

Annotated entities:
- Condition: "Cough"